Clinical trial exclusion criteria:
Plan for diagnostic-only coronary angiography
On colchicine chronically
History of intolerance to colchicine
Glomerular filtration rate <30mL/minute or on dialysis
Active malignancy or infection
History of myelodysplasia
High-dose statin load <24 hours prior to procedure
Use of oral steroids or non-steroidal anti-inflammatory agents other than aspirin within 72 hours or 3 times the agent's half-life (whichever is longer)
Use of strong CYP3A4/P-glycoprotein inhibitors (specifically ritonavir, ketoconazole, clarithromycin, cyclosporine, diltiazem and verapamil)
Unable to consent
Participating in a competing study

Annotated entities:
- Procedure: "coronary angiography"
- Qualifier: "diagnostic-only"
- Drug: "colchicine"
- Multiplier: "chronically"
- Condition: "intolerance"
- Drug: "colchicine"
- Measurement: "Glomerular filtration rate"
- Value: "<30mL/minute"
- Procedure: "dialysis"
- Condition: "malignancy"
- Qualifier: "Active"
- Condition: "infection"
- Condition: "myelodysplasia"
- Drug: "High-dose statin"
- Temporal: "<24 hours prior to procedure"
- Reference_point: "procedure"
- Drug: "oral steroids"
- Drug: "non-steroidal anti-inflammatory agents"
- Drug: "aspirin"
- Negation: "other than"
- Temporal: "within 72 hours"
- Temporal: "within 3 times the agent's half-life"
- Reference_point: "3 times the agent's half-life"
- Reference_point: "72 hours"
- Drug: "strong CYP3A4/P-glycoprotein inhibitors"
- Drug: "ritonavir"
- Drug: "ketoconazole"
- Drug: "clarithromycin"
- Drug: "cyclosporine"
- Drug: "diltiazem"
- Drug: "verapamil"
- Non-query-able: "Unable to consent"
- Non-query-able: "Participating in a competing study"